Contraindicated to either diuretics or BCAA

The above is a clinical trial exclusion criterion. Annotated with entity spans:
[Condition: Contraindicated] to either [Drug: diuretics] or [Drug: BCAA]